在內、外科病房常見病人出現譫妄（delirium），下列有關精神科醫師進行會診評估時應注意事項，何者錯誤？
A. 詳細詢問病史，包括病人過去內、外科病史及用藥史
B. 判讀相關之實驗檢查數據
C. 評估病人目前之定向感、認知功能及精神症狀
D. 無論如何一律先給予抗精神病藥物

正確答案：D. 無論如何一律先給予抗精神病藥物